甲狀腺（thyroid gland）手術，最可能造成下列何神經受損？
A. 喉內神經（internal laryngeal nerve）
B. 膈神經（phrenic nerve）
C. 頸襻下根（inferior root of ansa cervicalis）
D. 喉返神經（recurrent laryngeal nerve）

正確答案：D. 喉返神經（recurrent laryngeal nerve）